Male or female, aged = 18 to = 60 years on day of inclusion.

The above is a clinical trial inclusion criterion. Annotated with entity spans:
[Person: Male] or [Person: female], [Person: aged] [Value: = 18 to = 60 years] [Temporal: on day of inclusion].